Clinical trial inclusion criterion:
Admitted to any ICU and receiving invasive mechanical ventilation

Entity relations:
- Has_qualifier("mechanical ventilation", "invasive")